Prior pelvic radiotherapy except as part of combination therapy for prostate cancer

The above is a clinical trial inclusion criterion. Annotated with entity spans:
[Temporal: Prior] [Qualifier: pelvic] [Procedure: radiotherapy] [Negation: except] as part of [Procedure: combination therapy] for [Condition: prostate cancer]